Which antibodies cause Riedel thyroiditis?

Riedel thyroiditis (Immunoglobulin G4-related thyroid disease) is caused by IgG4 antibodies. It is part of the spectrum of Ig4-related sclerosing disease.
It is associated with fibrosis and inflammation of the thyroid gland.